Clinical trial inclusion criteria:
Normotensive controls
Stage I (140-159/90-99 mmHg) untreated subjects with essential hypertension
Patients with PA and stage I (140-159/90-99 mmHg) hypertension

Annotated entities:
- Procedure: "controls"
- Qualifier: "Normotensive"
- Condition: "essential hypertension"
- Qualifier: "Stage I"
- Qualifier: "untreated"
- Condition: "PA"
- Condition: "hypertension"
- Qualifier: "stage I"